7. Each volunteer must have acceptable medical history, physical examination and laboratory test

The above is a clinical trial inclusion criterion. Annotated with entity spans:
[Parsing_Error: 7.] [Post-eligibility: Each volunteer must have acceptable medical history, physical examination and laboratory test]